關於新生兒披衣菌感染（Chlamydia trachomatis）的肺炎，下列敘述何者錯誤？
A. 常有嗜伊紅性白血球增多（eosinophilia）的現象
B. 聽診時常常可以聽到wheezing
C. 通常不會發燒
D. 可以用紅黴素（erythromycin）治療

正確答案：B. 聽診時常常可以聽到wheezing